Clinical trial inclusion criterion:
Provide written informed consent before initiation of any study procedures

Annotated entities:
- Informed_consent: "Provide written informed consent before initiation of any study procedures"